Clinical trial inclusion criterion:
Male and/or female healthy volunteers, age 18 to 55 years. Females must be of non-childbearing potential.

Annotated entities:
- Person: "Male"
- Person: "female"
- Condition: "healthy"
- Person: "age"
- Value: "18 to 55 years"
- Person: "Females"
- Condition: "childbearing potential"
- Negation: "non"